一位84歲男性病患於幾年前罹患腦中風之後，長期臥床，常常有呼吸道感染或泌尿道感染。最近幾天病患開 始出現發燒及腹瀉等現象。於急診經檢查確定為偽黏膜性大腸炎，醫師開始使用抗生素治療，但治療幾天後，症狀一直沒有具體改善。這時家屬詢問國外研究顯示，偽黏膜性大腸炎可以使用糞便移植治療，不知道醫師是否會考慮這種治療？經查詢相關文獻，發現該文獻的證據等級為Ib，證據等級相當高，但該療法並非台灣對於偽黏膜性大腸炎的常規治療。下列敘述，何者錯誤？
A. 依據實證醫學的理念，應該依據最新最好的證據來治療患者。本案中，既然該文獻的證據等級為Ib，屬於證據等級很高的文獻，可依照此治療方式來治療患者
B. 雖然該文獻證據等級很高，但並沒有本土相關文獻的證據，該文獻的結果是否可以應用於國內的患者，容
C. 不論證據等級高低，只要是新的治療方法，都必須經過衛生福利部核准後，進行人體試	加以檢	其治療效果以及治療相關安全性之後，才能應用於臨床患者
D. 臨床上，醫師有遵從醫療常規來治療病患的義務。但並沒有遵從最新最好的證據等級之文獻來治療患者的義務

正確答案：A. 依據實證醫學的理念，應該依據最新最好的證據來治療患者。本案中，既然該文獻的證據等級為Ib，屬於證據等級很高的文獻，可依照此治療方式來治療患者